En la activación del complemento sérico, el ensamblaje del Complejo de Ataque a la Membrana comienza por:
1. C9.
2. C5b.
3. C3a.
4. C6.
5. C8.

Respuesta correcta: 2. C5b.